PICU admission

The above is a clinical trial inclusion criterion. Annotated with entity spans:
[Visit: PICU] [Procedure: admission]